Los hematíes típicos de la anemia falciforme son los:
1. Dianocitos.
2. Depranocitos.
3. Dacriocitos.
4. Ovalocitos.
5. Acantocitos.

Respuesta correcta: 2. Depranocitos.